inflammatory or chronic disorder

The above is a clinical trial exclusion criterion. Annotated with entity spans:
inflammatory or [Condition: chronic disorder]